T. R. de 89 años, presenta inestabilidad y ha sufrido una caída. Respecto a las caídas en las personas mayores, es correcto que:
1. La mayoría de las caídas se producen realizando actividades peligrosas.
2. Los factores que más influyen en el riesgo de caídas son los intrínsecos influidos por las enfermedades de base.
3. Los factores que más influyen en el riesgo de caídas son los relacionados con los cambios propios del envejecimiento.
4. Supone mayor riesgo de caídas el subir escaleras que bajarlas.
5. Los factores que más influyen en la génesis de caídas en mayores frágiles son los extrínsecos.

Respuesta correcta: 2. Los factores que más influyen en el riesgo de caídas son los intrínsecos influidos por las enfermedades de base.